Clinical trial exclusion criterion:
Pregnant patients or those who are breastfeeding will be deemed ineligible.

Annotated entities:
- Pregnancy_considerations: "Pregnant patients or those who are breastfeeding will be deemed ineligible"